Clinical trial exclusion criterion:
Patients allergic to lidocaine or other local anesthetics;

Entity relations:
- Has_qualifier("local anesthetics", "other")
- AND("allergic", "lidocaine")
- OR("lidocaine", "local anesthetics")